55 歲女性病患，沒有受傷病史，最近 2 個月來常感到肩膀疼痛及穿脫內衣越來越困難，但吃飯和寫字沒有問題，其最有可能是下列何種疾病？
A. 肱骨外上髁炎（lateral epicondylitis）
B. 頸神經病變（cervical radiculopathy）
C. 肩關節脫臼（shoulder dislocation）
D. 冰凍肩（frozen shoulder）

正確答案：D. 冰凍肩（frozen shoulder）